El proteoglucano más importante del cartílago hialino es:
1. Agrecano
2. Condroitín sulfato 4.
3. Heparina.
4. Versicano.
5. Dermatán sulfato.

Respuesta correcta: 1. Agrecano